Clinical trial exclusion criterion:
Apnea-hypopnea index of less than 5 h-1 or greater than 30 h-1.

Annotated entities:
- Measurement: "Apnea-hypopnea index"
- Value: "less than 5 h-1 or greater than 30 h-1"